Clinical trial inclusion criterion:
breast cancer ( DIN 2 e 3, o LIN 2 e 3 sec. Tavassoli) scheduled for nipple-sparing mastectomy, simple mastectomy, skin-sparing mastectomy, skin-reducing mastectomy c, lymphnode biopsy and axillary dissection;

Annotated entities:
- Condition: "breast cancer"
- Measurement: "DIN"
- Value: "2 e 3"
- Measurement: "LIN"
- Value: "2 e 3 sec"
- Condition: "nipple-sparing mastectomy"
- Mood: "scheduled for"
- Condition: "simple mastectomy"
- Condition: "skin-sparing mastectomy"
- Condition: "skin-reducing mastectomy"
- Condition: "lymphnode biopsy"
- Condition: "axillary dissection"